Clinical trial inclusion criterion:
Recipient is Age = 18 years

Entity relations:
- Has_value("Age", "= 18 years")